Clinical trial inclusion criterion:
Adult patients up to age 75 years, undergoing elective, ambulatory, arthroscopic rotator cuff repair.

Annotated entities:
- Person: "Adult"
- Person: "age"
- Value: "up to 75 years"
- Qualifier: "elective"
- Visit: "ambulatory"
- Procedure: "arthroscopic rotator cuff repair"